Clinical trial inclusion criteria:
Patient who undergoing gynecologic laparoscopic surgery
Patient who agrees to participate in this study
Patient able to speak and understand Thai
Patient able to complete the questionnaire

Annotated entities:
- Procedure: "gynecologic laparoscopic surgery"
- Observation: "agrees to participate in this study"
- Informed_consent: "Patient who agrees to participate in this study"
- Observation: "able to speak and understand Thai"
- Post-eligibility: "Patient able to speak and understand Thai"
- Observation: "able to complete the questionnaire"